La monitorización de fármacos NO está justificada en:
1. Fármacos con amplio margen terapéutico.
2. Fármacos con dificultad para valorar eficacia o toxicidad en clínica.
3. Fármacos con elevada variabilidad farmacocinética.
4. Fármacos con relación concentraciónrespuesta definida.

Respuesta correcta: 1. Fármacos con amplio margen terapéutico.